Subject who showed medically significant adverse events or intolerance with aripiprazole during screening period or as prior experiences.

The above is a clinical trial exclusion criterion. Annotated with entity spans:
Subject who showed [Qualifier: medically significant] [Condition: adverse events] or [Condition: intolerance] with [Drug: aripiprazole] [Temporal: during screening period] or [Temporal: as prior experiences].